¿Cuál es el objetivo del programa de tratamiento Coping Cat “El gato que se las arregla” de Kendall?
1. La mejoría de las habilidades de solución de problemas interpersonales.
2. La mejoría del estado de ánimo.
3. La disminución de los síntomas de ansiedad.
4. La disminución de las conductas impulsivas.
5. El tratamiento de la fobia a animales.

Respuesta correcta: 3. La disminución de los síntomas de ansiedad.